下列何者不屬於肺氣腫（emphysema）應有的變化？
A. 呼吸道阻力增加（increased airway resistance）
B. 擴散容積增加（increased diffusing capacity）
C. 總肺容量增加（increased total lung capacity）
D. 通氣灌流失衡（ventilation perfusion mismatch）

正確答案：B. 擴散容積增加（increased diffusing capacity）